antiseizure medications including valproic acid, zonisamide, topiramate, and lamotrigine

The above is a clinical trial exclusion criterion. Annotated with entity spans:
[Drug: antiseizure medications] including [Drug: valproic acid], [Drug: zonisamide], [Drug: topiramate], and [Drug: lamotrigine]